Clinical trial exclusion criterion:
Inability to consent/refusal Allergy to any of the study medications Multiple traumatic injuries Contraindication to neuraxial or general anesthesia Pregnancy

Annotated entities:
- Observation: "Inability to consent"
- Observation: "refusal"
- Line: "Inability to consent/refusal"
- Line: "Allergy to any of the study medications"
- Line: "Multiple traumatic injuries"
- Line: "Contraindication to neuraxial or general anesthesia"
- Line: "Pregnancy"
- Condition: "Allergy"
- Drug: "study medications"
- Condition: "Multiple traumatic injuries"
- Condition: "Contraindication"
- Procedure: "neuraxial anesthesia"
- Procedure: "general anesthesia"
- Condition: "Pregnancy"